下列何者不是結核菌之特色？
A. 抗酸性染色呈陽性
B. 約 2 小時分裂一次
C. 斷續使用抗結核藥物容易產生抗藥性
D. 可對多種抗結核藥物產生抗藥性

正確答案：B. 約 2 小時分裂一次